Clinical trial exclusion criterion:
smokers

Annotated entities:
- Observation: "smokers"